What organism causes scarlet fever also known as scarletina?

Scarlet fever is a disease which can occur as a result of a group A streptococcus (group A strep), group C Streptococcus and Streptococcus hemolyticus infection.